Clinical trial exclusion criterion:
Decompensated heart failure or hemodynamic instability

Annotated entities:
- Qualifier: "Decompensated"
- Condition: "heart failure"
- Condition: "hemodynamic instability"